One relapse in the previous year and at least 1 T1 Gadolinium (Gd)+ lesion or 9 or more T2 lesions, while on therapy with other disease modifying drugs (DMDs)

The above is a clinical trial inclusion criterion. Annotated with entity spans:
[Multiplier: One] [Condition: relapse] [Temporal: in the previous year] and [Multiplier: at least 1] [Qualifier: T1 Gadolinium (Gd)+] [Condition: lesion] or [Multiplier: 9 or more] [Condition: T2 lesions], [Temporal: while on therapy] with [Qualifier: other] [Drug: disease modifying drugs (DMDs)]